心偏右症（Dextrocardia）為心臟變異的一種。此種症狀的心尖（apex）朝向右側。造成此種症狀的原因是：
A. 橫隔板（Septum transversum）的缺陷
B. 大動脈異位（Transposition of great arteries）
C. 心管（Heart tube）在摺疊時之向右方摺疊
D. 心室間隔（Interventricular septum）形成時之缺陷

正確答案：C. 心管（Heart tube）在摺疊時之向右方摺疊